El terpeno que contiene 10 átomos de carbono y deriva de dos unidades de isopreno se denomina:
1. Diterpeno.
2. Monoterpeno.
3. Sesquiterpeno.
4. Triterpeno.
5. Meroterpeno.

Respuesta correcta: 2. Monoterpeno.